Clinical trial exclusion criterion:
Low vitamin B12 Levels (< 300 pg/mL)

Entity relations:
- Has_value("vitamin B12 Levels", "< 300 pg/mL")